Las crisis epilépticas generalizadas, tipo gran mal, se caracterizan por los siguientes datos, EXCEPTO uno de ellos, señálelo:
1. Pérdida de conciencia.
2. Convulsiones tónico-clónicas.
3. Fase poscrítica.
4. Duración inferior a 30 segundos.

Respuesta correcta: 4. Duración inferior a 30 segundos.